Clinical trial inclusion criterion:
Male or female patients = 18 and = 85 years of age

Entity relations:
- Has_value("age", "= 18 and = 85 years")
- OR("Male", "female")